Clinical trial exclusion criterion:
Contraindication for prescription of Firmagon®

Annotated entities:
- Condition: "Contraindication"
- Drug: "Firmagon"